Clinical trial exclusion criterion:
Slit lamp findings that would contraindicate contact lens wear such as:

Annotated entities:
- Procedure: "Slit lamp"
- Value: "findings"
- Undefined_semantics: "findings"
- Condition: "contraindicate contact lens"
- Undefined_semantics: "contraindicate contact lens"
- Parsing_Error: "Slit lamp findings that would contraindicate contact lens wear such as:"